一般藥理學上，下列何種點眼藥物，並不具降眼壓的效果？
A. atropine
B. betaxolol
C. carteolol
D. dorzolamide

正確答案：A. atropine